American Society Anesthesiologists (ASA) physical status I-III

The above is a clinical trial inclusion criterion. Annotated with entity spans:
[Measurement: American Society Anesthesiologists] ([Measurement: ASA]) physical status [Value: I-III]